elevated levels of NT-proBNP (at least >125 pg/ml)

The above is a clinical trial inclusion criterion. Annotated with entity spans:
[Qualifier: elevated] levels of [Measurement: NT-proBNP] ([Value: at least >125 pg/ml])